Las cifras de prevalencia de los problemas depresivos:
1. Han decrecido en las últimas décadas.
2. Son mayores en el ámbito rural que en el urbano.
3. Son mayores en mujeres que en hombres.
4. No muestran diferencias en función del sexo.

Respuesta correcta: 3. Son mayores en mujeres que en hombres.